貧血（anemia）患者，其血紅素（hemoglobin）濃度僅達正常值之50%，此外並無其它心肺功能異常。此人進行正常換氣（ventilation）時，與健康的人相比較，下列那些參數顯	偏低？①體動脈血中氧分壓  ②體動脈血中氧合血紅素飽和百分比  ③肺泡內氧分壓 ④供給周邊組織的氧氣量
A. 僅②③④
B. 僅①②④
C. 僅②④
D. 僅④

正確答案：D. 僅④